Patients had an inadequate response to, or had failed to tolerate, 1 or more of the following conventional therapies: oral 5-aminosalicylates, oral corticosteroids, azathioprine (AZA), and/or 6-mercaptopurine (6MP); or corticosteroid dependent (ie, an inability to taper corticosteroids without recurrence of UC symptoms).

The above is a clinical trial inclusion criterion. Annotated with entity spans:
Patients had an [Condition: inadequate response] to, or had [Condition: failed to tolerate], [Multiplier: 1 or more] of the following conventional therapies: [Drug: oral 5-aminosalicylates], [Drug: oral corticosteroids], [Drug: azathioprine (AZA)], and/or [Drug: 6-mercaptopurine (6MP)]; or [Drug: corticosteroid] [Condition: dependent] [Non-representable: (ie, an inability to taper corticosteroids without recurrence of UC symptoms)].